已知有 B 型肝炎免疫力的人，由下列何種血清標記可區分 HBV 是自然感染（immunity through natural infection）而非經由疫苗獲得抗體？
A. HBsAg (-)
B. Anti-HBs(+)
C. Anti-HBc(+)
D. Anti-HBe(-)

正確答案：C. Anti-HBc(+)